17. Severe gastrointestinal disease.

The above is a clinical trial exclusion criterion. Annotated with entity spans:
[Parsing_Error: 17.] [Qualifier: Severe] [Condition: gastrointestinal disease].